Clinical trial exclusion criterion:
Hemosiderosis/hemochromatosis ( patients can still be included in the non-ferumoxytol arm)

Entity relations:
- OR("Hemosiderosis", "hemochromatosis")